Clinical trial exclusion criterion:
Pregnancy or unwilling to adopt reliable contraceptive measures during the month after drug application;

Annotated entities:
- Pregnancy_considerations: "Pregnancy or unwilling to adopt reliable contraceptive measures during the month after drug application"